Signed informed parental/patient consent form

The above is a clinical trial inclusion criterion. Annotated with entity spans:
[Informed_consent: Signed informed parental/patient consent form]